下列有關必需胺基酸（essential amino acids）的敘述，何者錯誤？
A. 細菌（如 Escherichia coli）可以合成
B. 人類必須從食物中補充
C. 其合成之過程較非必需胺基酸複雜
D. 全部都屬 aromatic amino acids

正確答案：D. 全部都屬 aromatic amino acids